Clinical trial inclusion criterion:
hypoechoic uterine leiomyoma (echogenicity <3),

Annotated entities:
- Condition: "uterine leiomyoma"
- Qualifier: "hypoechoic"
- Measurement: "echogenicity"
- Value: "<3"